Adequate hepatic and renal function

The above is a clinical trial inclusion criterion. Annotated with entity spans:
[Condition: Adequate hepatic] and renal function